Which cancer types are associated with mutations in the TWIST1 gene?

Loss-of-function mutations of TWIST1, a catalytic component of polycomb repressive complex 1 (PRC1), are observed in ~\n10% of patients with gastric, non-small cell lung, breast ductal carcinomas, nonsmall cell lung cancer, prostate cancer, ovarian cancer, breast tumor, papillary thyroid cancer, cervical cancer, adenoid cystic carcinoma, salivary gland neoplasms.